Clinical trial exclusion criterion:
Require combined surgery that may confound the results of the study;

Annotated entities:
- Procedure: "combined surgery"
- Mood: "Require"
- Qualifier: "may confound the results of the study"